Clinical trial exclusion criterion:
Body weight less than 50 kg

Entity relations:
- Has_value("Body weight", "less than 50 kg")